Clinical trial exclusion criterion:
Active myocarditis; malfunctioning artificial heart valve.

Entity relations:
- Has_qualifier("artificial heart valve", "malfunctioning")
- OR("Active myocarditis", "artificial heart valve")